一位 59 歲的家庭主婦到急診求診，主訴是寡尿已有 1 週。她在八個月前因大腸癌接受手術。過去有腎結石病史，急診的檢查發現血清肌酸酐 16.5 mg/dL，尿液檢查正常。急診醫師給她放一個 foley catheter，發現只有 30 mL 尿液。為排除阻塞性腎病變是造成急性腎衰竭的原因，下一步你會優先安排那項檢查？
A. IVP（Intravenous pyelography）
B. Antegrade pyelography
C. Renal ultrasonography
D. Voiding cystourethrography

正確答案：C. Renal ultrasonography